Las fibras intrafusales:
1. Se contraen en su región central.
2. Generan la mayor parte de la tensión muscular.
3. Se disponen en serie con las fibras extrafusales.
4. Están inervadas por motoneuronas alfa.
5. Reciben inervación sensorial de fibras “Ia”.

Respuesta correcta: 5. Reciben inervación sensorial de fibras “Ia”.